Clinical trial exclusion criterion:
Previous treatment with anti-VEGF drugs or corticosteroid or grid laser photocoagulation (study eye)

Annotated entities:
- Drug: "anti-VEGF drugs"
- Drug: "corticosteroid"
- Procedure: "grid laser photocoagulation ("